以下關於惡性間皮瘤（malignant mesothelioma）的描述，何者錯誤？
A. 病患通常有石綿（asbestos）暴露的病史
B. 腫瘤會侵犯壁層肋膜及臟層肋膜
C. 病患臨床的表現會有呼吸困難及肋膜積水的現象
D. 五年存活率約為 70%

正確答案：D. 五年存活率約為 70%